Clinical trial exclusion criterion:
received telbivudine as the antiviral therapy or have received more than one NA in the past.

Entity relations:
- Subsumes("antiviral therapy", "telbivudine")
- Has_temporal("NA", "in the past")
- OR("antiviral therapy", "more than one", "NA")